服用下列何種降血壓藥物後，易產生鎮靜的副作用？
A. nifedipine
B. clonidine
C. hydralazine
D. losartan

正確答案：B. clonidine